¿En cuál de los siguientes tipos celulares se encuentra el complejo CD3?:
1. Linfocitos T.
2. Linfocitos B.
3. Eosinófilos.
4. Células dendríticas foliculares.
5. Células endoteliales.

Respuesta correcta: 1. Linfocitos T.